Planned administration/ administration of a vaccine not foreseen by the study protocol during the period starting one month before each dose of vaccine(s) and ending 7 days after dose 1 and dose 2 or 1 month after dose 3.

The above is a clinical trial exclusion criterion. Annotated with entity spans:
[Mood: Planned] administration/ administration of a [Drug: vaccine] [Qualifier: not foreseen by the study protocol] during the [Temporal: period starting one month before each dose of vaccine(s)] and [Temporal: ending 7 days after dose 1 and dose 2] or [Temporal: 1 month after dose 3].